當光線進入視網膜時，最先經過下列何種細胞？
A. rod or cone cells
B. bipolar cells
C. ganglion cells
D. horizontal cells

正確答案：C. ganglion cells